Clinical trial inclusion criterion:
a single or dual chamber MRI conditional pacemaker (BSCI) or

Annotated entities:
- Qualifier: "single chamber"
- Qualifier: "dual chamber"
- Device: "pacemaker"
- Device: "BSCI"
- Qualifier: "MRI conditional"